Clinical trial exclusion criterion:
All subjects with any cardiac disease or history of cardiac arrhythmias will be excluded.

Annotated entities:
- Condition: "cardiac disease"
- Condition: "cardiac arrhythmias"
- Temporal: "history"